Clinical trial exclusion criterion:
Current participation in transcranial magnetic stimulation studies

Annotated entities:
- Procedure: "transcranial magnetic stimulation studies"
- Temporal: "Current"